Clinical trial inclusion criterion:
Active LN with proteinuria (urine protein/creatinine ratio >1.0 or 24-hr urine protein >1.0 g at baseline), with or without hematuria.

Annotated entities:
- Condition: "LN"
- Condition: "proteinuria"
- Measurement: "urine protein/creatinine ratio"
- Value: ">1.0"
- Measurement: "24-hr urine protein"
- Value: ">1.0 g"
- Qualifier: "Active"
- Condition: "hematuria"